Clinical trial exclusion criterion:
Exposure to more than four new chemical entities within 12 months prior to the first dosing day.

Entity relations:
- Has_multiplier("new chemical entities", "more than four")
- Has_index("within 12 months prior to the first dosing day", "the first dosing day")
- Has_temporal("new chemical entities", "within 12 months prior to the first dosing day")